Clinical trial exclusion criterion:
Perforated corneal ulcer

Entity relations:
- Has_qualifier("corneal ulcer", "Perforated")